Clinical trial exclusion criterion:
Hypersensitivity to everolimus, sirolimus, or other rapamycin deriviatives

Entity relations:
- OR("everolimus", "rapamycin", "sirolimus")